Clinical trial inclusion criterion:
• Human leukocyte antigen B27 (HLA-B27)+ gene

Annotated entities:
- Condition: "gene Human leukocyte antigen B27"
- Condition: "(HLA-B27)+"